Clinical trial inclusion criterion:
Patients must not have received prior radiation therapy to the breast.

Annotated entities:
- Procedure: "radiation therapy"
- Negation: "not"